一位 70 歲男性至急診室就診，主訴近二日左側眼皮不能閉合、流眼淚、嘴角下垂，下列敘述何者不恰當？
A. 為典型的貝爾氏麻痺（Bell's palsy），可完全排除腦血管疾病的可能
B. 致病原因可能與單純疱疹病毒（HSV）感染有關
C. 人工淚液與眼藥膏可以避免眼角膜過於乾燥
D. 可開立口服類固醇治療

正確答案：A. 為典型的貝爾氏麻痺（Bell's palsy），可完全排除腦血管疾病的可能